Clinical trial exclusion criterion:
Known or suspected illicit drug or alcohol abuse

Entity relations:
- OR("illicit drug abuse", "alcohol abuse")